Clinical trial inclusion criterion:
Intellectual level which allows to filling in the diaries for registering of symptoms at home;

Annotated entities:
- Undefined_semantics: "Intellectual level which allows to filling in the diaries for registering of symptoms at home;"
- Post-eligibility: "Intellectual level which allows to filling in the diaries for registering of symptoms at home;"
- Non-query-able: "Intellectual level which allows to filling in the diaries for registering of symptoms at home;"